Women must not be breastfeeding

The above is a clinical trial inclusion criterion. Annotated with entity spans:
[Pregnancy_considerations: Women must not be breastfeeding]